比較兩組病人的存活時間（survival time）可使用下列何種統計方法？
A. Chi-square test
B. Student's t test
C. Mann-Whitney test
D. Log rank test

正確答案：D. Log rank test